Clinical trial exclusion criterion:
End stage renal disease or on dialysis

Annotated entities:
- Condition: "End stage renal disease"
- Procedure: "dialysis"